History of substance dependence diagnosis by MINI-KID (excluding tobacco) or positive urine toxicology.

The above is a clinical trial exclusion criterion. Annotated with entity spans:
[Temporal: History] of [Condition: substance dependence] diagnosis by [Procedure: MINI-KID] ([Negation: excluding] [Drug: tobacco]) or [Value: positive] [Measurement: urine toxicology].